下列何者緊貼於膀胱頸？
A. 子宮
B. 陰道
C. 直腸
D. 前列腺

正確答案：D. 前列腺